因甲狀腺功能亢進造成心律不整的患者，應儘量避免使用下列何種藥物，以避免甲狀腺功能亢進惡化？
A. digoxin
B. amiodarone
C. propranolol
D. diltiazem

正確答案：B. amiodarone